Clinical trial exclusion criterion:
Painful regular uterine contraction and/or preterm labor

Annotated entities:
- Condition: "Painful regular uterine contraction"
- Condition: "preterm labor"